對於腦中風患者的日常生活功能訓練，下列敘述那一項正確？
A. 穿著上衣時應先穿健側上肢，再穿患側上肢
B. 由平躺坐起時，應先翻身至健側肢體邊再坐起來
C. 欲由床上轉位至輪椅時，應將輪椅擺在健側邊、面向床頭
D. 欲由輪椅轉位至床上時，應將輪椅擺在健側邊、面向床尾

正確答案：B. 由平躺坐起時，應先翻身至健側肢體邊再坐起來